Only patients with atrial fibrillation, above 18 years, and with TTR <50% based on the last three values of INR will be included in this study.

The above is a clinical trial inclusion criterion. Annotated with entity spans:
Only patients with [Condition: atrial fibrillation], [Value: above 18 years], and with [Measurement: TTR] [Value: <50%] [Qualifier: based on the last three values of INR] will be included in this study.